Clinical trial exclusion criterion:
(8)Regular usage of folic acid supplements or compounds containing folic acid in the past 3 months;

Entity relations:
- Has_multiplier("folic acid supplements", "Regular usage")
- OR("folic acid supplements", "compounds containing folic acid")
- OR("Regular usage", "in the past 3 months")